Clinical trial inclusion criterion:
english-speaking and literate

Annotated entities:
- Observation: "english-speaking"
- Observation: "literate"